Having previously undergone BTI. The last injection must have been performed at least 4 months prior to inclusion.

The above is a clinical trial inclusion criterion. Annotated with entity spans:
Having previously undergone [Procedure: BTI]. The last [Procedure: injection] must have been performed [Temporal: at least 4 months prior to inclusion].